Severe chronic renal failure

The above is a clinical trial exclusion criterion. Annotated with entity spans:
[Qualifier: Severe] [Qualifier: chronic] [Condition: renal failure]